Currently enrolled in another clinical study or has used any investigational drug or device within 30 days before providing informed consent

The above is a clinical trial exclusion criterion. Annotated with entity spans:
[Temporal: Currently] [Observation: enrolled in] [Qualifier: another] clinical study or has used any [Drug: investigational drug] or [Device: device] [Temporal: within 30 days before providing informed consent]